Female subjects who are pregnant or lactating

The above is a clinical trial exclusion criterion. Annotated with entity spans:
[Person: Female] subjects who are [Condition: pregnant] or [Condition: lactating]